一位 30 歲女性，BMI＝36，經診斷為多囊性卵巢症候群（polycystic ovary syndrome）來醫院求診，主訴想要懷孕。下列那種治療或建議對她幫助最少？
A. 安排陰道超音波及輸卵管攝影檢查，並請先生進行精液檢查（semen analysis）
B. 減重
C. metformin or clomiphene
D. spironolactone

正確答案：D. spironolactone